What is calciphylaxis

Calcific uraemic arteriolopathy also known as calciphylaxis is an unusual and potentially fatal condition characterised by small-vessel calcification and ischaemic skin necrosis.